Los aminoglucósidos pueden producir:
1. Hepatotoxicidad.
2. Anormalidades hematológicas.
3. Toxicidad adrenal.
4. Toxicidad ocular.
5. Toxicidad renal.

Respuesta correcta: 5. Toxicidad renal.